El virus de la hepatitis A y el de la hepatitis C se diferencian por:
1. Su tipo de material genético.
2. La estructura de la cápside.
3. La presencia o ausencia de una envoltura alrededor de la cápside.
4. La metodología empleada para su detección.

Respuesta correcta: 3. La presencia o ausencia de una envoltura alrededor de la cápside.